The use of beta blockers within 2 months of randomization

The above is a clinical trial exclusion criterion. Annotated with entity spans:
The use of [Drug: beta blockers] [Temporal: within 2 months of randomization]